Clinical trial inclusion criterion:
Newly diagnosed patients with previous excisional biopsy. OR

Entity relations:
- Has_temporal("excisional biopsy", "previous")